Adult patients aged (>18), males and females, undergoing elective coronary artery bypass graft (CABG) surgery with cardiopulmonary bypass (CPB).

The above is a clinical trial inclusion criterion. Annotated with entity spans:
Adult patients [Person: aged] ([Value: >18]), [Person: males] and [Person: females], undergoing [Qualifier: elective] coronary artery bypass graft ([Procedure: CABG]) [Procedure: surgery] with [Procedure: cardiopulmonary bypass] ([Procedure: CPB]).